Clinical trial inclusion criterion:
Must have pathologically confirmed invasive adenocarcinoma or ductal carcinoma in situ of the breast.

Entity relations:
- Has_value("pathologically", "confirmed")
- AND("invasive adenocarcinoma", "pathologically")
- AND("ductal carcinoma in situ", "pathologically")
- Has_qualifier("invasive adenocarcinoma", "of the breast")
- Has_qualifier("ductal carcinoma in situ", "of the breast")
- OR("invasive adenocarcinoma", "ductal carcinoma in situ")